10 歲男童從四天前開始晚上睡覺時常會咳嗽醒過來。這幾天來稍微用力就喘而且咳個不停，呼吸有 時有細喘鳴聲無囉音，體溫正常。則下列何者是他的胸部 X 光預期發現？
A. 大葉性肺炎
B. 毛玻璃樣肺實質變化
C. 肺氣腫變化
D. 肺門淋巴腺腫大

正確答案：C. 肺氣腫變化